Serum Cr = 1 × ULN endogenous creatinine clearance>50ml/min (Cockcroft-Gault formula)

The above is a clinical trial inclusion criterion. Annotated with entity spans:
[Measurement: Serum Cr] [Value: = 1 × ULN] [Measurement: endogenous creatinine clearance][Value: >50ml/min] (Cockcroft-Gault formula)